Clinical trial exclusion criterion:
History of allergic reactions attributed to compounds of similar chemical or biologic composition to misoprostol

Annotated entities:
- Temporal: "History"
- Condition: "allergic reactions"
- Drug: "compounds of similar chemical or biologic composition to misoprostol"
- Drug: "misoprostol"